Clinical trial exclusion criterion:
Prior CABG.

Entity relations:
- Has_temporal("CABG", "Prior")